張先生登山遭毒蛇咬傷，經注射抗蛇毒血清後症狀獲得控制而康復。如果他下一次再被蛇咬，接受抗蛇毒血清治療時，需注意血清病（serum sickness）的不良反應。下列關於血清病的敘述，何者正確？
A. 是因為毒蛇的血清經由傷口進入病患而引起疾病
B. 是因為抗原抗體複合體堆積所產生
C. 是因為蛇毒具特異性的 T 細胞聚集在血清中產生組織傷害
D. 血清中的病毒削弱免疫能力而產生疾病

正確答案：B. 是因為抗原抗體複合體堆積所產生